El déficit de glucuronidasa es una alteración de:
1. Ciclo de la urea.
2. Alfa-glucosidasa ácida.
3. Transporte intestinal de los carbohidratos.
4. Metabolismo de los mucopolisacaridos.

Respuesta correcta: 4. Metabolismo de los mucopolisacaridos.